• Enthesitis (heel) physician-diagnosed (spontaneous pain or tenderness at examination of the site of the insertion of the Achilles tendon or plantar fascia)

The above is a clinical trial inclusion criterion. Annotated with entity spans:
• [Condition: Enthesitis] ([Qualifier: heel]) physician-diagnosed (spontaneous [Condition: pain] or [Condition: tenderness] at examination of the [Qualifier: site of the insertion of the Achilles tendon] or [Qualifier: plantar fascia])